有關內生軟骨瘤（enchondroma）之敘述，下列何者錯誤？
A. 常見於手或腳的近端指（趾）骨
B. 所謂 Maffucci's syndrome 是指多發性內生軟骨瘤造成肢體變形
C. 常造成病理性骨折
D. 侵犯長骨時，在 X 光片下內含物可見到鈣化點

正確答案：B. 所謂 Maffucci's syndrome 是指多發性內生軟骨瘤造成肢體變形